Clinical trial inclusion criterion:
TB screening: chest X-Ray unless performed in the last 6 months

Annotated entities:
- Procedure: "chest X-Ray"
- Procedure: "TB screening"